Clinical trial exclusion criterion:
Patients who are primarily managed and regularly followed-up by a cardiologist for their HF

Annotated entities:
- Non-query-able: "Patients who are primarily managed and regularly followed-up by a cardiologist for their HF"